Clinical trial inclusion criterion:
Children aged 3-16 with a parent/guardian (hereafter termed parent) reported history of allergy to a penicillin antibiotic in which the reported allergic reaction occurred at least six months prior to the current PED visit.

Entity relations:
- Has_value("aged", "3-16")
- AND("allergy", "penicillin antibiotic")
- Has_temporal("allergic reaction", "at least six months prior to the current PED visit")
- AND("allergy", "allergic reaction")